格蘭氏陰性菌細胞壁成分中的脂多醣體（Lipopolysaccharide, LPS）是很強的免疫刺激物質。生物體感受到 LPS 的刺激時會產生血壓降低，體溫上升的症狀。有時甚至會導致休克。主要產生體溫上升的免疫細胞和媒介物質，下列何者最為重要？
A. 自然殺手細胞產生的第一型干擾素
B. 巨噬細胞產生的 IL-1
C. T 細胞產生的 IL-4
D. 樹突細胞產生的 IL-10

正確答案：B. 巨噬細胞產生的 IL-1